Clinical trial exclusion criterion:
Participants with T2DM who have hypoglycemia unawareness

Annotated entities:
- Condition: "T2DM"
- Condition: "hypoglycemia unawareness"